ASA physical status classification I or II

The above is a clinical trial inclusion criterion. Annotated with entity spans:
[Measurement: ASA physical status classification] [Value: I or II]